下列有關ST節段上升的心肌梗塞（ST-elevation myocardial infarction，STEMI）的敍述，何者錯誤？
A. 病態生理學為血管內粥狀硬化斑瑰破裂，產生急性血栓將血管完全阻塞
B. 心肌肌鈣蛋白（cardiac troponin）升高，通常可持續一週
C. 通常到院前死亡是因為急性心衰竭
D. 下壁心肌梗塞（inferior wall myocardial infarction）病患例行要做右前胸壁心電圖

正確答案：C. 通常到院前死亡是因為急性心衰竭